remaining vestibular function

The above is a clinical trial exclusion criterion. Annotated with entity spans:
[Condition: remaining vestibular function]